Clinical trial inclusion criterion:
HCV RNA viral load of ≥ 10*5* IU/mL (100,000 IU/mL) at screening

Annotated entities:
- Measurement: "HCV RNA viral load"
- Value: "≥ 10*5* IU/mL"
- Value: "100,000 IU/mL"
- Temporal: "at screening"
- Reference_point: "screening"